腦膜瘤（meningioma）三個最好發之位置為何？
A. 矢狀竇旁－大腦鐮（parasagittal-falx）、岩骨（petrous bone）、顱凸處（convexity）
B. 矢狀竇旁－大腦鐮（parasagittal-falx）、顱凸處（convexity）、蝶骨翼（sphenoid wing）
C. 矢狀竇旁－大腦鐮（parasagittal-falx）、蝶骨平面（planum sphenoidale）、顱凸處（convexity）
D. 顱凸處（convexity）、蝶骨翼（sphenoid wing）、岩骨（petrous bone）

正確答案：B. 矢狀竇旁－大腦鐮（parasagittal-falx）、顱凸處（convexity）、蝶骨翼（sphenoid wing）